一位 3 歲男孩反覆發生化膿性細菌感染，但是他接種疫苗後的抗體反應正常，且他感染水痘及麻疹後復原正常。他最可能是下列那一種細胞的功能缺陷？
A. 中性球（Neutrophils）
B. 吞噬細胞（Macrophages）
C. B 淋巴細胞（B lymphocytes）
D. T 淋巴細胞（T lymphocytes）

正確答案：A. 中性球（Neutrophils）